Clinical trial inclusion criterion:
Epilepsy partial seizure subjects.

Annotated entities:
- Condition: "Epilepsy"
- Condition: "partial seizure"